Clinical trial inclusion criterion:
Tumors

Annotated entities:
- Condition: "Tumors"